Clinical trial exclusion criterion:
allergy to artemisinin drugs

Entity relations:
- AND("allergy", "artemisinin drugs")